Hemoglobin level of 7.0 g/dL or greater

The above is a clinical trial inclusion criterion. Annotated with entity spans:
[Measurement: Hemoglobin level] of [Value: 7.0 g/dL or greater]